Clinical trial exclusion criterion:
Presentation with acute liver failure, defined as presence of hepatic encephalopathy and coagulopathy (INR > 1.5)

Entity relations:
- Has_value("INR", "> 1.5")
- AND("coagulopathy", "INR")
- AND("acute liver failure", "hepatic encephalopathy")
- AND("acute liver failure", "coagulopathy")